Clinical trial inclusion criterion:
Patients with a calculated PRA of 0% by solid phase technique and absence of anti-HLA class I and class II antibodies by single antigen test (Luminex®).

Entity relations:
- Has_value("calculated PRA", "0%")
- Has_qualifier("calculated PRA", "solid phase technique")
- Has_context("single antigen test (Luminex®)", "absence of anti-HLA class I")
- Has_context("single antigen test (Luminex®)", "absence of class II")